Clinical trial inclusion criterion:
Consecutive 30 female patients presenting to our clinic for brow lifting with botulinum toxin will be randomized to receive one of the two injection techniques

Annotated entities:
- Procedure: "brow lifting"
- Drug: "botulinum toxin"
- Person: "female"
- Multiplier: "30"